Clinical trial exclusion criterion:
Hypertension with pregnancy.

Annotated entities:
- Condition: "Hypertension"
- Condition: "pregnancy"